prisoner

The above is a clinical trial exclusion criterion. Annotated with entity spans:
[Person: prisoner]